Clinical trial exclusion criterion:
diagnosis,

Annotated entities:
- Condition: "diagnosis"